congenital or acquired bleeding tendency

The above is a clinical trial exclusion criterion. Annotated with entity spans:
[Qualifier: congenital] or [Qualifier: acquired] [Condition: bleeding tendency]